Lactante de 3 meses correctamente vacunado para su edad, que tras dos semanas de rinorrea, estornudos y tos, ingresa por intensificación de los accesos de tos, con cianosis al final de los mismos, que finalizan con inspiración profunda o gallo inspiratorio, precisando estimulación, aspiración de secrecciones y oxígeno para recuperarse de los mismos. Según su sospecha diagnóstica y con respecto a la vacuna de dicha enfermedad, todas son verdaderas EXCEPTO:
1. La vacuna en España se administra combinada con la antidiftérica y antitetánica.
2. Se deben vacunar a los adultos que vayan a estar en contacto con lactantes menores de 6 meses.
3. La inmunidad tanto natural como vacunal, permanece de por vida.
4. La vacunación está preparada a partir de microorganismos muertos.

Respuesta correcta: 3. La inmunidad tanto natural como vacunal, permanece de por vida.